Clinical trial exclusion criterion:
Positive test at screening for anti-HIV, anti-HCV.

Entity relations:
- Has_value("test for anti-HIV", "Positive")
- Has_temporal("test for anti-HIV", "at screening")
- OR("test for anti-HIV", "test for anti-HCV")